Subjects who, during the course of the study, would be likely to require treatment with prohibited concomitant therapy .

The above is a clinical trial exclusion criterion. Annotated with entity spans:
[Non-query-able: Subjects who, during the course of the study, would be likely to require treatment with prohibited concomitant therapy] .